Clinical trial exclusion criterion:
YAG laser treatment in the study eye in last 30 days prior to study enrollment.

Annotated entities:
- Procedure: "YAG laser treatment"
- Qualifier: "in the study eye"
- Temporal: "in last 30 days prior to study enrollment"
- Reference_point: "study enrollment"